La transcetolasa cataliza la transformación de ribosa-5-fostato y xilulosa-5-fosfato en:
1. Dos moléculas de ribulosa-5-fostato.
2. Sedoheptulosa-7-fosfato y gliceraldehido-3fosfato.
3. Fructosa-6-fosfato y eritrosa-4-fosfato.
4. Gliceraldehido-3-fosfato y glucosa-6-fosfato.
5. 6-Fosfogluconato y gliceraldehido-3-fosfato.

Respuesta correcta: 2. Sedoheptulosa-7-fosfato y gliceraldehido-3fosfato.